Current treatment with cholestyramine or cholestipol resins

The above is a clinical trial exclusion criterion. Annotated with entity spans:
[Temporal: Current] treatment with [Drug: cholestyramine] or [Drug: cholestipol resins]